空氣污染指標（PSI）與下列那五種不同污染物的濃度有關？
A. SO3、CO、O3、NO2、PM10
B. SO2、CO2、O2、NO2、PM10
C. SO2、CO、O2、NO3、PM1.0
D. SO2、CO、O3、NO2、PM10

正確答案：D. SO2、CO、O3、NO2、PM10